Clinical trial exclusion criterion:
Current treatment with tetracycline or derivative

Annotated entities:
- Temporal: "Current"
- Procedure: "treatment"
- Drug: "tetracycline"
- Drug: "tetracycline derivative"